BMI above 30.

The above is a clinical trial exclusion criterion. Annotated with entity spans:
[Measurement: BMI] [Value: above 30].